Clinical trial exclusion criterion:
Pleural or interstitial disease that precludes surgery.

Annotated entities:
- Condition: "Pleural disease"
- Condition: "interstitial disease"
- Procedure: "surgery"
- Negation: "precludes"
- Qualifier: "precludes surgery"